Clinical trial inclusion criterion:
indication for osteoporosis therapy according to international guidelines

Entity relations:
- multi("osteoporosis therapy", "osteoporosis")
- Has_mood("osteoporosis therapy", "indication for")
- Has_qualifier("indication for", "international guidelines")